Clinical trial exclusion criterion:
patients undergoing other bariatric procedures

Entity relations:
- Has_qualifier("bariatric procedures", "other")
- Has_temporal("bariatric procedures", "undergoing")